List the main proteins found in human saliva.

Amylases
Cystatins
Immunoglobulins
Mucins